5. Cardiopulmonary diseases

The above is a clinical trial exclusion criterion. Annotated with entity spans:
[Parsing_Error: 5.] [Condition: Cardiopulmonary diseases]